下列何者會直接跨越輸尿管？
A. 子宮動脈
B. 陰道動脈
C. 陰部內動脈
D. 直腸中動脈

正確答案：A. 子宮動脈